Clinical trial inclusion criterion:
Positive ANA OR anti-dsDNA within one year of screening

Annotated entities:
- Measurement: "ANA"
- Value: "Positive"
- Measurement: "anti-dsDNA"
- Temporal: "within one year of screening"
- Reference_point: "screening"